懷孕期間母親接受手術，胎兒最大的風險為：
A. 感染
B. 早產
C. 先天畸形
D. 子宮內死亡

正確答案：B. 早產